En unos análisis de rutina de una mujer de 59 años, fumadora de 20 cigarrillos/día desde hace 25 años, se detecta una hipercalcemia de 11,3 mg/dL con un fósforo de 3,4 mg/dL. NO resultaría eficiente de entrada:
1. Determinar niveles séricos de PTH.
2. Determinar niveles séricos de vitamina D.
3. Determinación de hidroxiprolinuria.
4. Una radiografía simple de tórax.

Respuesta correcta: 3. Determinación de hidroxiprolinuria.